Clinical trial inclusion criterion:
Patients meet criteria for low to moderate risk for moderate exercise based oon the ACSM guidelines.

Entity relations:
- Has_value("risk for moderate exercise", "low")
- Subsumes("risk for moderate exercise", "ACSM guidelines")
- OR("low", "moderate")